異位性皮膚炎（atopic dermatitis）的敘述，下列何者錯誤？
A. 病程為急性、突發性
B. 劇癢
C. 皮膚乾燥
D. 嬰兒期，好發的部位包括臉部

正確答案：A. 病程為急性、突發性